In what year did Gregor Mendel die?

Johann Gregor Mendel 1822-1884